Clinical trial exclusion criterion:
Sarcoma or squamous cell histology.

Entity relations:
- AND("histology", "Sarcoma")
- OR("Sarcoma", "squamous cell")